Which substance use is associated with Brodifacoum poisoning?

Brodifacoum poisoning was linked to marijuana use.